Clinical trial inclusion criterion:
Hemoglobin (hgb) greater than or equal to 10 g/dL without transfusional support or growth factor use in the 4 weeks before study randomization

Entity relations:
- Subsumes("Hemoglobin", "hgb")
- Has_index("in the 4 weeks before study randomization", "study randomization")
- Has_negation("transfusional support", "without")
- Has_value("Hemoglobin", "greater than 10 g/dL")
- Has_temporal("Hemoglobin", "in the 4 weeks before study randomization")
- Has_temporal("transfusional support", "in the 4 weeks before study randomization")
- OR("greater than 10 g/dL", "equal to 10 g/dL")
- OR("transfusional support", "growth factor use")